Patients with ongoing infection including HIV and Hepatitis

The above is a clinical trial exclusion criterion. Annotated with entity spans:
Patients with [Qualifier: ongoing] [Condition: infection] including [Condition: HIV] [Parsing_Error: and] [Condition: Hepatitis]